Clinical trial inclusion criterion:
Psychiatric patients already diagnosed of schizophrenia or bipolar disorder, according to the Diagnostic and Statistical Manual of Mental Disorders- IV, Diagnostic and Statistical Manual of Mental Disorders- V or International Code of Disease criteria.

Annotated entities:
- Condition: "schizophrenia"
- Condition: "bipolar disorder"
- Measurement: "Diagnostic and Statistical Manual of Mental Disorders- IV"
- Measurement: "Diagnostic and Statistical Manual of Mental Disorders- V"
- Measurement: "International Code of Disease criteria"